American Society of Anesthesiologists (ASA) physical status 1 to 3

The above is a clinical trial inclusion criterion. Annotated with entity spans:
[Measurement: American Society of Anesthesiologists (ASA) physical status] [Value: 1 to 3]